Los síntomas motores en la enfermedad de Parkinson predominan y definen esta entidad. No obstante, los síntomas en otras esferas, son a veces muy relevantes y se denominan con el nombre general de "Manifestaciones no motoras de la enfermedad de Parkinson" ¿Cual de los siguientes se considera un síntoma no motor de la enfermedad de Parkinson?
1. Hipoglucemia.
2. Hipotensión ortostática.
3. Crisis de ausencia.
4. Cefalea.
5. Polineuropatía motora.

Respuesta correcta: 2. Hipotensión ortostática.